Clinical trial exclusion criterion:
3. Total bilirubin > 2 × ULN

Annotated entities:
- Parsing_Error: "3."
- Measurement: "Total bilirubin"
- Value: "> 2 × ULN"